Clinical trial inclusion criterion:
Subject has any mental or neuromuscular disorder which would create an unacceptable risk of fixation failure or complications in postoperative care.

Annotated entities:
- Condition: "mental disorder"
- Condition: "neuromuscular disorder"
- Condition: "fixation failure"
- Qualifier: "unacceptable"
- Condition: "complications"
- Mood: "risk of"